68歲女性病人，高血壓及糖尿病10年，兩年前血液肌酸酐2.0 mg/dL，五週前血液肌酸酐7.5 mg/dL。最近1週高血壓更嚴重，出現瞻妄、少尿、水腫、呼吸困難、嘔吐。血液肌酸酐9.6
A. 腎臟切片檢查
B. 透析治療
C. 以angiotensin-converting enzyme inhibitor治療
D. 以脈衝式類固醇（pulse methylprednisolone）治療

正確答案：B. 透析治療